Severe renal insufficiency with estimated glomerular filtration rate <30 ml/min/ 1.73 m2

The above is a clinical trial exclusion criterion. Annotated with entity spans:
[Qualifier: Severe] [Condition: renal insufficiency] with [Measurement: estimated glomerular filtration rate] [Value: <30 ml/min/ 1.73 m2]